30 歲男性因空腹時上腹痛接受胃鏡檢查，發現十二指腸球部有 A2 ulcer，且其 rapid urease test 呈現陽性。下列何項藥物不適合用於此位病人的治療？
A. bismuth subsalicylate
B. metronidazole
C. clarithromycin
D. cefixime

正確答案：D. cefixime